What antibiotic is currently used as the standard of care for Clostridium Difficile infection as of 2018

fidaxomicin has recently been introduced as a new antibiotic that has been shown to significantly reduce the recurrence of this infection. fidaxomicin is a new antibiotic used to treat clostridium difficile infection (cdi).